Clinical trial inclusion criterion:
marked disability owing to primary generalized or segmental dystonia, despite optimal pharmacologic treatment

Entity relations:
- Has_qualifier("dystonia", "generalized")
- Has_qualifier("dystonia", "primary")
- AND("disability", "dystonia")
- Has_qualifier("pharmacologic treatment", "optimal")
- AND("disability", "pharmacologic treatment")
- OR("generalized", "segmental")